Heart failure, New York Heart Association(NYHA) III/IV or eject fraction(EF)<40%;

The above is a clinical trial exclusion criterion. Annotated with entity spans:
[Condition: Heart failure], [Measurement: New York Heart Association(NYHA)] [Value: III/IV] or [Measurement: eject fraction(EF)][Value: <40%];